Esophageal stenosis preventing the passage of an endoscope,

The above is a clinical trial exclusion criterion. Annotated with entity spans:
[Condition: Esophageal stenosis] [Mood: preventing the] [Procedure: passage of an endoscope],